Clinical trial exclusion criterion:
have an organic brain disease

Annotated entities:
- Condition: "organic brain disease"